Clinical trial exclusion criterion:
Subject has a reversible causes for AF like hyperthyroidism and alcoholism.

Entity relations:
- OR("hyperthyroidism", "alcoholism")